Patients with central canal stenosis.

The above is a clinical trial exclusion criterion. Annotated with entity spans:
Patients with [Condition: central canal stenosis].